Clinical trial exclusion criteria:
Lack of understanding of the study
contra-indication to nicotine replacement therapy
health status incompatible with detention in police cells
serious mental disorder
usual place of residence outside Seine-Saint-Denis

Annotated entities:
- Observation: "Lack of understanding of the study"
- Condition: "contra-indication"
- Procedure: "nicotine replacement therapy"
- Observation: "incompatible with detention in police cells"
- Condition: "serious mental disorder"
- Qualifier: "outside Seine-Saint-Denis"
- Observation: "place of residence"